En un proyecto de investigación cualitativa, señale la opción que NO es correcta:
1. Las preguntas se pueden referir a experiencias y creencias del entrevistado.
2. El investigador puede opinar y expresar sus valores.
3. El proceso de investigación ha de ser riguroso y respetuoso con las evidencias.
4. El proceso de investigación no tiene importancia en esta metodología.

Respuesta correcta: 4. El proceso de investigación no tiene importancia en esta metodología.